Clinical trial exclusion criterion:
Known acute pancreatitis or known severe hepatic dysfunction, including hepatic failure, cirrhosis, portal hypertension (oesophageal varices) and active hepatitis

Entity relations:
- Has_qualifier("hepatic dysfunction", "severe")
- Subsumes("portal hypertension", "oesophageal varices")
- Subsumes("hepatic dysfunction", "hepatic failure")
- OR("acute pancreatitis", "hepatic dysfunction")
- OR("hepatic failure", "cirrhosis", "portal hypertension", "active hepatitis")